Any suicidal behavior in the past based on the C-SSRS

The above is a clinical trial exclusion criterion. Annotated with entity spans:
Any [Condition: suicidal behavior] [Temporal: in the past] based on the [Procedure: C-SSRS]